Clinical trial inclusion criterion:
No previous history of endoscopic, radiologic, or surgical therapy for varices or ascites

Annotated entities:
- Negation: "No"
- Condition: "varices"
- Condition: "ascites"
- Procedure: "surgical therapy"
- Procedure: "radiologic therapy"
- Procedure: "endoscopic therapy"